Clinical trial exclusion criterion:
BMI <18.5

Entity relations:
- Has_value("BMI", "<18.5")